Clinical trial exclusion criterion:
History of hypersensitivity reaction to apixaban

Entity relations:
- AND("hypersensitivity", "apixaban")